Which company produces Glybera?

Glybera is a product of Chiesi Pharma.